Pregnancy or women with potential childbearing

The above is a clinical trial exclusion criterion. Annotated with entity spans:
[Pregnancy_considerations: Pregnancy or women with potential childbearing]